Clinical trial exclusion criteria:
1. Prior exposure to doxorubicin, PLD or any other anthracycline, motolimod and other TLR agonists, MEDI4736 or checkpoint inhibitors, such as anti-CTLA4 and anti-PD1/anti-PD-L1 antibodies.
2. Subjects with platinum-refractory disease, defined as disease progression while receiving first line platinum-based therapy.
3. Clinically significant persistent immune-related adverse events following prior therapy.
4. Subjects with history or evidence upon physical examination of CNS disease, including primary brain tumor, seizures not controlled with standard medical therapy, any brain metastases, or, within six months prior to Day 1 of this study, history of cerebrovascular accident (CVA, stroke), transient ischemic attack (TIA) or subarachnoid hemorrhage.
5. Subjects with clinically significant cardiovascular disease. This includes:
1. Resisted hypertension
2. Myocardial infarction or unstable angina within 6 months prior to Day 1 of the study.
3. History of serious ventricular arrhythmia (i.e., ventricular tachycardia or ventricular fibrillation) or cardiac arrhythmias requiring anti-arrhythmic medications, except for atrial fibrillation that is well controlled with anti-arrhythmic medication.
4. Baseline ejection fraction ≤ 50% as assessed by echocardiogram or MUGA.
5. New York Heart Association (NYHA) Class II or higher congestive heart failure.
6. Grade 2 or higher peripheral ischemia, except for brief (< 24 hrs) episodes of ischemia managed non-surgically and without permanent deficit.
6. History of pneumonitis or interstitial lung disease.
7. Active, suspected or prior documented autoimmune disease (including inflammatory bowel disease, celiac disease, Wegner's granulomatosis, active Hashimoto's thyroiditis, rheumatoid arthritis, lupus, scleroderma and its variants, multiple sclerosis, myasthenia gravis). Vitiligo, type I diabetes mellitus, residual hypothyroidism due to autoimmune condition only requiring hormone replacement, psoriasis not requiring systemic treatment, or conditions not expected to recur in the absence of an external trigger are permitted.
8. Other malignancy within 2 years prior to Day 1 of the study, except for those treated with surgical intervention only.
9. Subjects with clinical symptoms or signs of gastrointestinal obstruction and/or who require drainage gastrostomy tube and/or parenteral hydration or nutrition.
10. Known immunodeficiency or HIV, Hepatitis B or Hepatitis C positivity.
11. History of severe allergic reactions to any unknown allergens or components of the study drugs.
12. Other serious illnesses (e.g., serious infections requiring antibiotics, bleeding disorders).
13. Prior treatment in any other interventional clinical trial within 4 weeks prior to Day 1 of the study.
14. Mental impairment that may compromise compliance with the requirements of the study.
15. Lack of availability for immunological and clinical follow-up assessment.
16. Women who are breastfeeding or pregnant as evidenced by positive serum pregnancy test
17. Subjects unwilling to use acceptable methods of contraception.
-Female subjects should refrain from breastfeeding throughout this period.
18. Any condition that, in the clinical judgment of the treating physician, is likely to prevent the subject from complying with any aspect of the protocol or that may put the subject at unacceptable risk.
19. Subjects must not donate blood while on study and for at least 90 days following the last MEDI4736 treatment.
20. History of allogeneic organ transplant

Annotated entities:
- Parsing_Error: "1."
- Drug: "doxorubicin"
- Drug: "PLD"
- Drug: "anthracycline"
- Drug: "motolimod"
- Drug: "TLR agonists"
- Drug: "MEDI4736"
- Drug: "checkpoint inhibitors"
- Drug: "anti-CTLA4"
- Drug: "anti-PD1 antibodies"
- Drug: "anti-PD-L1 antibodies"
- Grammar_Error: "and"
- Temporal: "Prior"
- Parsing_Error: "2."
- Condition: "platinum-refractory disease"
- Undefined_semantics: "platinum-refractory disease"
- Condition: "disease progression"
- Temporal: "while receiving first line platinum-based therapy"
- Reference_point: "first line platinum-based therapy"
- Parsing_Error: "3."
- Condition: "immune-related adverse events"
- Temporal: "following prior therapy"
- Reference_point: "prior therapy"
- Qualifier: "Clinically significant"
- Qualifier: "persistent"
- Subjective_judgement: "Clinically significant"
- Undefined_semantics: "Clinically significant"
- Parsing_Error: "4."
- Condition: "CNS disease"
- Condition: "primary brain tumor"
- Condition: "seizures"
- Qualifier: "controlled"
- Negation: "not"
- Drug: "standard medical therapy"
- Condition: "brain metastases"
- Temporal: "within six months prior to Day 1 of this study"
- Reference_point: "Day 1 of this study"
- Condition: "cerebrovascular accident"
- Condition: "CVA"
- Condition: "stroke"
- Condition: "transient ischemic attack (TIA)"
- Condition: "subarachnoid hemorrhage"
- Parsing_Error: "5."
- Condition: "cardiovascular disease"
- Qualifier: "clinically significant"
- Subjective_judgement: "clinically significant"
- Undefined_semantics: "clinically significant"
- Parsing_Error: "This includes:"
- Parsing_Error: "1."
- Condition: "Resisted hypertension"
- Parsing_Error: "2."
- Condition: "Myocardial infarction"
- Condition: "unstable angina"
- Temporal: "within 6 months prior to Day 1 of the study"
- Reference_point: "Day 1 of the study"
- Parsing_Error: "3."
- Condition: "ventricular arrhythmia"
- Condition: "ventricular tachycardia"
- Condition: "ventricular fibrillation"
- Qualifier: "serious"
- Temporal: "History"
- Condition: "cardiac arrhythmias"
- Drug: "anti-arrhythmic medications"
- Qualifier: "requiring anti-arrhythmic medications"
- Condition: "atrial fibrillation"
- Negation: "except"
- Qualifier: "well controlled with anti-arrhythmic medication"
- Drug: "anti-arrhythmic medication"
- Parsing_Error: "4."
- Measurement: "ejection fraction"
- Temporal: "Baseline"
- Value: "≤ 50%"
- Procedure: "echocardiogram"
- Procedure: "MUGA"
- Parsing_Error: "5."
- Measurement: "New York Heart Association (NYHA)"
- Value: "Class II or higher"
- Condition: "congestive heart failure"
- Parsing_Error: "6."
- Condition: "peripheral ischemia"
- Qualifier: "Grade 2 or higher"
- Value: "2 or higher"
- Temporal: "brief"
- Value: "< 24 hrs"
- Condition: "ischemia"
- Procedure: "surgically"
- Negation: "non"
- Condition: "permanent deficit"
- Negation: "without"
- Negation: "except"
- Parsing_Error: "6."
- Condition: "pneumonitis"
- Condition: "interstitial lung disease"
- Temporal: "History"
- Parsing_Error: "7."
- Condition: "autoimmune disease"
- Condition: "inflammatory bowel disease"
- Condition: "celiac disease"
- Condition: "Wegner's granulomatosis"
- Condition: "Hashimoto's thyroiditis"
- Condition: "rheumatoid arthritis"
- Condition: "lupus"
- Condition: "scleroderma"
- Condition: "scleroderma variants"
- Condition: "multiple sclerosis"
- Condition: "myasthenia gravis"
- Condition: "Vitiligo"
- Condition: "type I diabetes mellitus"
- Condition: "residual hypothyroidism"
- Condition: "autoimmune condition"
- Qualifier: "due to autoimmune condition"
- Drug: "hormone replacement"
- Qualifier: "requiring hormone replacement"
- Qualifier: "requiring systemic treatment"
- Procedure: "systemic treatment"
- Negation: "not"
- Condition: "psoriasis"
- Qualifier: "not expected to recur"
- Subjective_judgement: "not expected to recur"
- Condition: "conditions"
- Undefined_semantics: "conditions"
- Parsing_Error: "8."
- Temporal: "within 2 years prior to Day 1 of the study"
- Reference_point: "Day 1 of the study"
- Condition: "malignancy"
- Procedure: "surgical intervention"
- Negation: "except for"
- Condition: "those"
- Undefined_semantics: "those"
- Parsing_Error: "9."
- Condition: "clinical symptoms of gastrointestinal obstruction"
- Condition: "signs of gastrointestinal obstruction"
- Device: "drainage gastrostomy tube"
- Procedure: "parenteral hydration"
- Procedure: "parenteral nutrition"
- Parsing_Error: "10."
- Condition: "immunodeficiency"
- Condition: "HIV"
- Condition: "Hepatitis B"
- Condition: "Hepatitis C"
- Parsing_Error: "11."
- Condition: "allergic reactions"
- Qualifier: "severe"
- Temporal: "History"
- Drug: "to any unknown allergens or components of the study drugs"
- Context_Error: "to any unknown allergens or components of the study drugs"
- Parsing_Error: "12."
- Condition: "illnesses"
- Qualifier: "serious"
- Subjective_judgement: "serious"
- Undefined_semantics: "serious"
- Condition: "infections requiring antibiotics"
- Undefined_semantics: "infections requiring antibiotics"
- Qualifier: "serious"
- Condition: "bleeding disorders"
- Parsing_Error: "13."
- Procedure: "treatment"
- Context_Error: "Prior treatment in any other interventional clinical trial within 4 weeks prior to Day 1 of the study."
- Temporal: "Prior"
- Parsing_Error: "14."
- Condition: "Mental impairment"
- Observation: "compromise compliance"
- Context_Error: "Mental impairment that may compromise compliance with the requirements of the study."
- Parsing_Error: "15."
- Negation: "Lack of"
- Procedure: "immunological follow-up assessment"
- Procedure: "clinical follow-up assessment"
- Mood: "availability for"
- Parsing_Error: "16."
- Observation: "breastfeeding"
- Condition: "pregnant"
- Person: "Women"
- Measurement: "serum pregnancy test"
- Value: "positive"
- Parsing_Error: "17."
- Condition: "unwilling"
- Qualifier: "acceptable"
- Procedure: "contraception"
- Person: "Female"
- Observation: "breastfeeding"
- Temporal: "throughout this period."
- Reference_point: "this period"
- Negation: "refrain from"
- Parsing_Error: "18."
- Non-query-able: "Any condition that, in the clinical judgment of the treating physician, is likely to prevent the subject from complying with any aspect of the protocol or that may put the subject at unacceptable risk."
- Parsing_Error: "19."
- Procedure: "donate blood"
- Negation: "not"
- Temporal: "while on study"
- Reference_point: "on study"
- Temporal: "for at least 90 days following the last MEDI4736 treatment"
- Reference_point: "the last MEDI4736 treatment"
- Parsing_Error: "20."
- Procedure: "allogeneic organ transplant"
- Temporal: "History"